Clinical trial inclusion criterion:
Non-ambulatory or 'exercise only' ambulators with or without assistive devices

Entity relations:
- OR("Non-ambulatory", "'exercise only' ambulators")